Healthy

The above is a clinical trial inclusion criterion. Annotated with entity spans:
[Condition: Healthy]